Inability to swallow capsules

The above is a clinical trial exclusion criterion. Annotated with entity spans:
[Condition: Inability to swallow capsules]